Clinical trial inclusion criterion:
Eastern Cooperative Oncology Group (ECOG) performance status of 0, 1 or 2.

Annotated entities:
- Measurement: "Eastern Cooperative Oncology Group (ECOG) performance status"
- Value: "0, 1 or 2"